Clinical trial exclusion criterion:
Are currently abstinent and do not agree to use a double-barrier method (as described above) or refrain from sexual activity during the study period and for 28 days after study drug discontinuation

Entity relations:
- Has_temporal("abstinent", "currently")
- Has_negation("sexual activity", "refrain")
- Has_index("during the study period", "the study period")
- Has_index("for 28 days after study drug discontinuation", "study drug discontinuation")
- multi("study drug discontinuation", "study drug")
- Has_temporal("double-barrier method", "during the study period")
- Has_context("double-barrier method", "do not agree")
- OR("double-barrier method", "sexual activity")